下列何種疾病造成之失智症狀是可逆的（reversible dementia）？
A. 愛滋病（acquired immunodeficiency syndrome, AIDS）
B. 阿茲海默症（Alzheimer's disease）
C. 甲狀腺功能低下（hypothyroidism）
D. 庫賈氏病（Creutzfeldt-Jakob disease）

正確答案：C. 甲狀腺功能低下（hypothyroidism）